Acute illness or infection;

The above is a clinical trial exclusion criterion. Annotated with entity spans:
[Qualifier: Acute] [Condition: illness] or [Condition: infection];